關於全髖人工關節置換術之後的日常活動之敘述，下列何者錯誤？
A. 坐姿時不要採用低位的座椅
B. 坐姿時兩側的膝關節不可以併攏
C. 睡覺時兩腳之間不可放置枕頭
D. 起立時身體不要過度向前傾靠

正確答案：C. 睡覺時兩腳之間不可放置枕頭